甲狀腺癌的病患接受手術切除，並完成高劑量之放射碘-131同位素治療後，臨床上，下列何者為血液中追蹤 甲狀腺癌是否復發之生化指標？
A. 四碘甲狀腺素（T4）
B. 三碘甲狀腺素（T3）
C. 甲狀腺球蛋白（thyroglobulin）
D. 甲促素（TSH）

正確答案：C. 甲狀腺球蛋白（thyroglobulin）